De acuerdo con la teoría de la emoción de Schachter y Singer, para que una persona experimente una emoción:
1. Tiene que estar en juego una meta.
2. Podría ser suficiente la creencia de estar fisiológicamente activado.
3. La activación fisiológica es necesaria y suficiente.
4. Se necesita tanto la activación fisiológica como la atribución cognitiva.

Respuesta correcta: 4. Se necesita tanto la activación fisiológica como la atribución cognitiva.